Clinical trial exclusion criterion:
thyroid dysfunction, with serum TSH out of normal limits

Annotated entities:
- Condition: "thyroid dysfunction"
- Measurement: "serum TSH"
- Value: "out of normal limits"